¿Cuál es la definición de un ciclador rápido?:
1. La presencia de al menos cuatro episodios del estado de ánimo (depresivos, maníacos, o hipomaníacos) en un periodo de 12 meses.
2. La presencia de al menos 6 episodios de ánimo en un periodo de 6 meses.
3. El cambio de un episodio ánimo a otro en un periodo inferior a 48 horas.
4. La presencia de más de dos episodios de manía o hipomanía detectables en un mes.
5. Pacientes con Trastorno Bipolar I o II con una hiperreactividad extrema a estresores mínimos.

Respuesta correcta: 1. La presencia de al menos cuatro episodios del estado de ánimo (depresivos, maníacos, o hipomaníacos) en un periodo de 12 meses.